正常人站立時，其肺內何處的氧分壓顯	高於體動脈血（systemic arterial blood）的氧分壓，而且該處的二氧化碳分壓顯	低於體動脈血的二氧化碳分壓？
A. 肺底（lung base）
B. 肺中段（middle lung）
C. 肺尖（lung apex）
D. 肺內到處都如此

正確答案：C. 肺尖（lung apex）